Clinical trial exclusion criterion:
Other contraindications mentioned in the "Summary of Product Characteristics" for the respective NOAC.

Entity relations:
- Has_qualifier("contraindications", "Other")
- Has_qualifier("contraindications", "Summary of Product Characteristics")
- AND("contraindications", "NOAC")